Clinical trial inclusion criteria:
Subjects who the investigator believes that they can and will comply with the requirements of the protocol should be enrolled in the study.
A male or female aged 61 years or above at the time of the first vaccination.
Written informed consent obtained from the subject.
Healthy subjects or subjects with well controlled underlying disease.

Annotated entities:
- Observation: "can and will comply with the requirements of the protocol"
- Person: "aged"
- Value: "61 years or above"
- Person: "female"
- Person: "male"
- Observation: "Written informed consent"
- Condition: "Healthy"
- Condition: "underlying disease"
- Qualifier: "well controlled"